Patients with congenital heart defects.

The above is a clinical trial exclusion criterion. Annotated with entity spans:
Patients with [Condition: congenital heart defects].